Subjects who had a hypersensitivity to antibiotics or antimycotics

The above is a clinical trial exclusion criterion. Annotated with entity spans:
Subjects who had a [Condition: hypersensitivity] to [Drug: antibiotics] or [Drug: antimycotics]